Clinical trial inclusion criterion:
3. Agree to daily application of gel and monitoring as per Daily Monitored Adherence (DMA) method

Annotated entities:
- Post-eligibility: "Agree to daily application of gel and monitoring as per Daily Monitored Adherence (DMA) method"
- Drug: "gel"
- Multiplier: "daily"
- Procedure: "monitoring"